Clinical trial exclusion criterion:
HCV, HIV, HDV coinfection.

Annotated entities:
- Condition: "HCV coinfection"
- Condition: "coinfection HIV"
- Condition: "HDV coinfection"